Clinical trial inclusion criterion:
a radiographically confirmed hip fracture

Annotated entities:
- Condition: "hip fracture"
- Procedure: "radiographically"